Clinical trial exclusion criterion:
2. Currently breast-feeding

Annotated entities:
- Condition: "breast-feeding"
- Temporal: "Currently"